Clinical trial inclusion criteria:
Men and women older than 18 years, scheduled consecutively to perform a coronary procedure in the department of hemodynamics of the National Institute of Cardiology "Ignacio Chavez".
Patients may have any of the following indications for cardiac catheterization: Thoracic pain under study. Stable chronic coronary disease. Acute myocardial infarction with ST segment elevation, not perfused (without timely reperfusion therapy) with less than 4 weeks of evolution. Acute myocardial infarction with ST-segment elevation, successful thrombolytic therapy, which will undergo drug-invasive therapy. Acute myocardial infarction without ST segment elevation. Unstable angina. Any acute coronary syndrome, to intervene non-infarct-related artery. Disease of any heart valve. Myocarditis or pericarditis. Dilated cardiomyopathy. Patients in renal or cardiac transplantation protocol for any etiology. Congenital heart disease that requires knowing the coronary anatomy prior to surgical correction.
The planned procedure can be any of the following: For diagnostic purposes (coronary angiography only, left catheterization, left and right catheterization). For therapeutic purposes: percutaneous coronary intervention (PCI), with or without stent placement.
A priori access must be right or left radial artery.
Radial arterial pulse may be present or absent by palpation.
Modified Allen or Barbeau test should be positive (presence of collateral palmar flow).

Annotated entities:
- Person: "Men"
- Person: "women"
- Person: "years"
- Value: "older than 18"
- Mood: "scheduled"
- Procedure: "coronary procedure"
- Visit: "the National Institute of Cardiology "Ignacio Chavez""
- Visit: "department of hemodynamics"
- Procedure: "cardiac catheterization"
- Condition: "indications"
- Condition: "Thoracic pain"
- Qualifier: "Stable"
- Condition: "chronic coronary disease"
- Condition: "Acute myocardial infarction"
- Condition: "ST segment elevation"
- Procedure: "reperfusion therapy"
- Qualifier: "timely"
- Negation: "without"
- Temporal: "with less than 4 weeks of evolution"
- Reference_point: "evolution"
- Condition: "Acute myocardial infarction"
- Condition: "ST-segment elevation"
- Procedure: "thrombolytic therapy"
- Qualifier: "successful"
- Mood: "will undergo"
- Procedure: "drug-invasive therapy"
- Condition: "Acute myocardial infarction"
- Negation: "without"
- Condition: "ST segment elevation"
- Condition: "Unstable angina"
- Condition: "acute coronary syndrome"
- Procedure: "intervene"
- Qualifier: "artery"
- Qualifier: "non-infarct-related"
- Condition: "Disease"
- Qualifier: "heart valve"
- Condition: "Myocarditis"
- Condition: "pericarditis"
- Condition: "cardiomyopathy"
- Qualifier: "Dilated"
- Condition: "cardiac transplantation"
- Condition: "renal transplantation"
- Condition: "Congenital heart disease"
- Qualifier: "knowing the coronary anatomy"
- Temporal: "prior to surgical correction."
- Reference_point: "surgical correction"
- Procedure: "procedure"
- Qualifier: "diagnostic"
- Procedure: "coronary angiography"
- Qualifier: "only"
- Procedure: "left catheterization"
- Procedure: "left catheterization"
- Procedure: "right catheterization"
- Procedure: "coronary angiography"
- Procedure: "coronary angiography"
- Qualifier: "therapeutic"
- Procedure: "percutaneous coronary intervention"
- Procedure: "PCI"
- Procedure: "stent placement"
- Procedure: "access"
- Qualifier: "priori"
- Qualifier: "left radial artery"
- Qualifier: "right radial artery"
- Condition: "pulse"
- Qualifier: "Radial arterial"
- Measurement: "palpation"
- Value: "absent"
- Value: "present"
- Measurement: "Modified Allen test"
- Measurement: "Barbeau test"
- Value: "positive"
- Condition: "collateral palmar flow"
- Qualifier: "presence"